Clinical trial exclusion criterion:
History of allergy, hypersensitivity, or intolerance to HORIZANT or any other gabapentin products (eg, Neurontin®, Gralise®).

Entity relations:
- Subsumes("gabapentin", "Neurontin")
- AND("allergy", "HORIZANT")
- OR("allergy", "hypersensitivity", "intolerance")
- OR("HORIZANT", "gabapentin")
- OR("Neurontin", "Gralise")